Clinical trial exclusion criterion:
bariatric surgery

Annotated entities:
- Procedure: "bariatric surgery"